Clinical trial inclusion criterion:
Seeking treatment for Alcohol Use Disorder

Entity relations:
- Has_mood("treatment", "Seeking")
- AND("treatment", "Alcohol Use Disorder")